Uncontrollable hypotension when upright

The above is a clinical trial exclusion criterion. Annotated with entity spans:
[Qualifier: Uncontrollable] [Condition: hypotension] [Qualifier: when upright]